下列何者不會產生腹水？
A. 肥胖
B. 肝硬化
C. 心臟衰竭
D. 腹膜發炎

正確答案：A. 肥胖